12. Lapatinib

The above is a clinical trial exclusion criterion. Annotated with entity spans:
[Parsing_Error: 12.] [Drug: Lapatinib]